Clinical trial exclusion criterion:
remain intubated in the postoperative period

Annotated entities:
- Condition: "intubated"
- Temporal: "in the postoperative period"
- Reference_point: "postoperative period"
- Procedure: "intubated"